Clinical trial inclusion criterion:
>7 Metabolic Equivalents

Entity relations:
- Has_value("Metabolic Equivalents", ">7")